下列有關鴉片類藥物（opioids）的敘述，何者錯誤？
A. 其受體包含 mu、kappa、delta與sigma受體
B. 所有opioid受體與G蛋白（G proteins）結合
C. 嗎啡引起的呼吸抑制是經由kappa受體
D. naloxone是一種opioid受體拮抗劑（antagonist）

正確答案：C. 嗎啡引起的呼吸抑制是經由kappa受體